Clinical trial exclusion criteria:
Current use of gabapentin or pregabalin
Allergy to gabapentin, acetaminophen, codeine, or ibuprofen
Self reported renal disease (severe impaired renal function)
Self reported current or chronic narcotic use (typical daily use)
Women with any issue that, in the opinion of the investigator, would interfere with study participation or generating accurate study data

Annotated entities:
- Drug: "gabapentin"
- Temporal: "Current"
- Drug: "pregabalin"
- Condition: "Allergy"
- Drug: "gabapentin"
- Drug: "acetaminophen"
- Drug: "codeine"
- Drug: "ibuprofen"
- Qualifier: "Self reported"
- Condition: "renal disease"
- Qualifier: "severe"
- Condition: "impaired renal function"
- Qualifier: "Self reported"
- Temporal: "current"
- Qualifier: "chronic"
- Condition: "narcotic use"
- Multiplier: "daily use"
- Non-representable: "Women with any issue that, in the opinion of the investigator, would interfere with study participation or generating accurate study data"